48歲女性無抽菸史，因爬樓梯會喘，到內科門診，身體診察發現右側有胸水，經超音波導引胸水引流，胸水細胞檢	發現adenocarcinoma，肺部電腦斷層顯現右下肺有3 cm腫瘤，併發兩側肺葉密密麻麻的轉移，核磁共振檢	發現腦部無轉移，經支氣管切片，證實為肺腺癌（lung adenocarcinoma），其他器官功能正常，醫師評估performance status (PS) 1。下列那項處置最適當？
A. 右下肺葉切除併縱膈腔淋巴腺廓清（right lower lobe lobectomy＋mediastinal lymph nodes dissection）
B. 單獨給與肋膜沾黏術（pleurodesis）
C. 右下肺腫瘤立體定位放射手術（stereotactic radiosurgery）
D. 用肺癌檢體，進行EGFR mutation及ALK rearrangements檢測

正確答案：D. 用肺癌檢體，進行EGFR mutation及ALK rearrangements檢測